Clinical trial inclusion criterion:
patients with a diagnosis of either cervical, thoracic, or lumbar facet or sacroiliac joint pain who have responded to medial branch blocks and are already scheduled for bilateral radiofrequency ablations

Entity relations:
- AND("responded", "medial branch blocks")
- Has_mood("bilateral radiofrequency ablations", "scheduled for")
- Has_context("cervical joint pain", "responded")
- OR("cervical joint pain", "thoracic joint pain", "lumbar facet joint pain", "sacroiliac joint pain")